Clinical trial exclusion criterion:
Newborns with infection of the umbilical cord at birth

Entity relations:
- Has_temporal("infection of the umbilical cord", "at birth")